need mechanical ventilation for more than 2 days

The above is a clinical trial inclusion criterion. Annotated with entity spans:
[Mood: need] [Procedure: mechanical ventilation] [Multiplier: for more than 2 days]